Clinical trial exclusion criterion:
HCV, HIV, or HDV coinfection.

Annotated entities:
- Condition: "HCV coinfection"
- Condition: "coinfection HIV"
- Condition: "HDV coinfection"